Clinical trial inclusion criterion:
Have a body mass index (BMI) = 35 kg/m2.

Entity relations:
- Has_value("body mass index (BMI)", "= 35 kg/m2")